Clinical trial inclusion criterion:
No evidence of arterial disease (Arterial Duplex or Ankle Brachial Pressure Index >0.9)

Annotated entities:
- Condition: "arterial disease"
- Negation: "No"
- Procedure: "Arterial Duplex"
- Measurement: "Ankle Brachial Pressure Index"
- Value: ">0.9"